Clinical trial exclusion criterion:
Known severe hepatic dysfunction

Entity relations:
- Has_qualifier("hepatic dysfunction", "severe")